下列何者不是以low tidal volume; high PEEP改善acute respiratory distress syndrome（ARDS）的目的？
A. 減少barotrauma
B. 減少氧氣毒性（oxygen toxicity）
C. 減少死亡率
D. 減少呼吸器引發的感染

正確答案：D. 減少呼吸器引發的感染